Clinical trial exclusion criterion:
GI intolerance of tuberculosis medications requiring discontinuation of tuberculosis medications.

Entity relations:
- AND("GI intolerance", "tuberculosis medications")
- AND("GI intolerance", "discontinuation")
- AND("discontinuation", "tuberculosis medications")